一個兩歲大的男孩，因走路不穩來診；其一個哥哥亦在約同樣年齡開始走路不穩，並在五歲時診斷為非何杰金氏淋巴瘤（non-Hodgkin lymphoma），於八歲時因反覆肺部感染，死於肺纖維化。此兩歲大的男孩及其哥哥血清甲型胎兒球蛋白（α-fetoprotein）皆偏高（此男孩是 129.43 ng/mL），而甲 型免疫球蛋白（immunoglobulin A）皆偏低（<6.67 mg/dL），下列何者為此男孩最可能診斷？
A. 運動失調血管擴張症候群（ataxia-telangiectasia）
B. 范康尼氏貧血（Fanconi's anemia）
C. 結節性硬化症（tuberous sclerosis）
D. Li-Fraumeni 症候群

正確答案：A. 運動失調血管擴張症候群（ataxia-telangiectasia）